Amphotericin B 破壞真菌細胞的主要標的是下列那一項？
A. 細胞壁
B. 細胞膜
C. 核酸
D. 能量傳遞

正確答案：B. 細胞膜